Clinical trial inclusion criterion:
Women aged 25-75 years old.

Annotated entities:
- Person: "Women"
- Person: "aged"
- Value: "25-75 years old"